Corrected (adjusted for serum albumin) serum calcium concentration < 8.0 mg/dl (2.00 mmol/L) or ≥ 12.0 mg/dl (3.00 mmol/L).

The above is a clinical trial exclusion criterion. Annotated with entity spans:
[Measurement: Corrected] (adjusted for serum albumin) serum calcium concentration [Value: < 8.0 mg/dl] ([Value: 2.00 mmol/L]) or [Value: ≥ 12.0 mg/dl] ([Value: 3.00 mmol/L]).